What is known about type D personality trait in cancer patients?

Reported prevalence rates of type D personality ranges from 19% to 22% in patients with cancer. In patients with cancer, Type D personality is associated with poor quality of life and mental health. Cancer patients with a Type D personality as compared with non-Type D patients perceive that they receive less information, report less satisfaction with the amount of received information, believe that their illness has significantly more serious consequences, will last significantly longer, and experience significantly more symptoms that they attribute to their illness. Also, they are more concerned about their illness, and their disease more often influences them emotionally. Also, Type D cancer patients are at an increased risk for comorbidity burden and increased health care utilization.